Clinical trial exclusion criterion:
Have characteristics contraindicating metformin or sulfonylurea use.

Entity relations:
- AND("characteristics contraindicating", "metformin")
- OR("metformin", "sulfonylurea")